Clinical trial exclusion criterion:
16. Known prior inability or unavailability to complete required study visits during study participation

Annotated entities:
- Parsing_Error: "16."
- Non-query-able: "Known prior inability or unavailability to complete required study visits during study participation"
- Context_Error: "required study visits"